Mujer de 78 años con antecedentes de diabetes tipo 2 en tratamiento con antidiabéticos orales, HTA en tratamiento con beta-bloqueantes e inhibidores de la ECA, e insuficiencia cardiaca congestiva grado 1 de la NYHA, con FEVI del 48%, y actualmente asintomática. Estado funcional: ECOG 0. Historia de 2 años de evolución de pequeños bultos en el cuello. Biopsia de adenopatía cervical: linfoma folicular grado 2 . Estudio de extensión: Hb 12 gr/dL, Leucocitos 6.900/microL (Neutrófilos 60%, Linfocitos 27%, Monocitos 6%, Eosinófilos 4%, Basófilos 4%) Plaquetas 220.000/microL. MO: infiltrada por Linfoma folicular. Creatinina 1,5 mg/dL, LDH 235 U/L, Beta2 microglobulina 2,1 microg/mL. TAC: adenopatías menores de 3 cm en territorios cervical, axilar, retroperitoneo, ilíacos e inguinales; hígado y bazo normales. ¿Cuál de los siguientes tratamientos es el más apropiado?
1. Rituximab-CHOP (Ciclofosfamida, Adriamicina, Vincristina, Prednisona).
2. Rituximab-CVP (Ciclofosfamida, Vincristina, Prednisona).
3. No tratar y vigilar (esperar y ver).
4. Rituximab-Bendamustina.

Respuesta correcta: 3. No tratar y vigilar (esperar y ver).